Clinical trial inclusion criteria:
Female
Age ≥18 years
Patients with a lesion > 0.5 cm in largest diameter size, initially scored BI-RADS® 3, 4a, 4b or 4c in B-mode ultrasound
Informed consent about histological examination (core cut biopsy (CCB), vacuum-assisted biopsy (VAB), fine needle aspiration (FNA) or surgery) has already been given in the course of clinical routine
Signed informed consent of study participation

Annotated entities:
- Person: "Female"
- Value: "≥18 years"
- Person: "Age"
- Condition: "lesion"
- Value: "> 0.5 cm"
- Measurement: "largest diameter size"
- Measurement: "BI-RADS®"
- Value: "3, 4a, 4b or 4c"
- Procedure: "B-mode ultrasound"
- Procedure: "histological examination"
- Procedure: "core cut biopsy (CCB)"
- Procedure: "vacuum-assisted biopsy (VAB)"
- Procedure: "fine needle aspiration (FNA)"
- Procedure: "surgery"
- Post-eligibility: "Informed consent"
- Post-eligibility: "Signed informed consent of study participation"